3. Co-interventions: Anticipated pharmacological intervention or procedure or participation in other studies that may interfere with this study.

The above is a clinical trial exclusion criterion. Annotated with entity spans:
[Parsing_Error: 3.] [Post-eligibility: Co-interventions: Anticipated pharmacological intervention or procedure or participation in other studies that may interfere with this study.]